Clinical trial exclusion criterion:
Drug and alcohol abuse

Annotated entities:
- Condition: "Drug abuse"
- Condition: "alcohol abuse"